Clinical trial inclusion criterion:
ASA physical status 1-3

Entity relations:
- Has_value("ASA physical status", "1-3")